Age > 18 years and < 90 years

The above is a clinical trial inclusion criterion. Annotated with entity spans:
[Person: Age] [Value: > 18 years] and [Value: < 90 years]